Known positive status for HIV, active hepatitis B or hepatitis C

The above is a clinical trial exclusion criterion. Annotated with entity spans:
Known positive status for [Condition: HIV], [Temporal: active] [Condition: hepatitis B] or [Condition: hepatitis C]